hypertensive disorders of pregnancy

The above is a clinical trial exclusion criterion. Annotated with entity spans:
[Condition: hypertensive disorders of pregnancy]